Hypersensitivity to camptothecin or nucleoside analogues.

The above is a clinical trial exclusion criterion. Annotated with entity spans:
[Condition: Hypersensitivity] to [Drug: camptothecin] or [Drug: nucleoside analogues].